Clinical trial exclusion criterion:
Known positive test(s) for human immunodeficiency virus infection (testing is not required in the absence of clinical suspicion).

Annotated entities:
- Measurement: "test(s) for human immunodeficiency virus infection"
- Value: "positive"